39 歲家庭主婦，住院前二年常有上腹部不適，來院前三天突然發生嚴重上腹痛伴隨嘔吐現象，在外院打針後止痛，抽血發現 ALT 超過 300 U/L 而轉診住院。抽血肝生化檢查顯示：AST：1090 U/L、 U/L、bilirubin：3.2/1.8 mg/dL、ALP：286 U/L，amylase、albumin 及 PT 正常。血液相顯示：WBC：12500/cmm、seg：86%。請問：最可能診斷為何？
A. 急性胰臟炎
B. 急性病毒性肝炎
C. 食物中毒
D. 膽石症併膽道炎

正確答案：D. 膽石症併膽道炎